臺灣中部地區曾發生的油症兒事件，是由於那一種物質的暴露所引起的？
A. 靈丹（lindane）
B. 多氯聯苯（PCB）
C. 甲苯（toluene）
D. 有機汞（organic mercury）

正確答案：B. 多氯聯苯（PCB）